Clinical trial inclusion criterion:
Unaware of HIV status at enrollment in follow-up cohort

Entity relations:
- Has_value("HIV status", "Unaware")
- multi("Unaware of HIV status", "HIV status")
- Has_index("at enrollment in follow-up cohort", "enrollment in follow-up cohort")
- Has_temporal("HIV status", "at enrollment in follow-up cohort")